Clinical trial inclusion criterion:
Onset of MS symptoms (as determined by a neurologist, either at present or retrospectively) within 10 years of the date the ICF is signed

Entity relations:
- Has_temporal("MS symptoms", "within 10 years")